Clinical trial exclusion criterion:
Other medical conditions, that, in the investigator's judgment, make study participation not in the individual's best interest.

Annotated entities:
- Non-query-able: "Other medical conditions, that, in the investigator's judgment, make study participation not in the individual's best interest."